下列原發性膽原性肝硬化（primary biliary cirrhosis）臨床的敘述，何者錯誤？
A. 皮膚搔癢（pruritus）
B. 好發於男性
C. 好發於女性
D. 絕大部分血清抗粒線體抗體（anti-mitochondrial antibody）升高

正確答案：B. 好發於男性